Clinical trial exclusion criterion:
History of overdose or suicidal ideation

Annotated entities:
- Condition: "overdose"
- Condition: "suicidal ideation"